Patients meeting the Rotterdam PCOS workshop criteria for polycystic ovary syndrome, defined by oligomenorrhea or amenorrhea and at least one of the following two signs: clinical or biochemical evidence of hyperandrogenism or ultrasound finding of polycystic appearing ovaries.

The above is a clinical trial inclusion criterion. Annotated with entity spans:
Patients [Value: meeting] the [Measurement: Rotterdam PCOS workshop criteria for polycystic ovary syndrome], defined by [Condition: oligomenorrhea] or [Condition: amenorrhea] and [Multiplier: at least one] of the following two signs: clinical or biochemical evidence of [Condition: hyperandrogenism] or [Procedure: ultrasound] finding of [Condition: polycystic] appearing ovaries.